在慢性穩定性心絞痛的病人，下列那種冠狀動脈的病變，並非手術治療的適應症（indication）？
A. 左主支有大於 60%之狹窄
B. 三條血管皆有大於 70%的狹窄，同時左心室功能變差
C. 二條血管有大於 70%的狹窄
D. 只有左前支近端有 70%以上的狹窄但左心室射出比小於 50%

正確答案：C. 二條血管有大於 70%的狹窄